Acute or serious medical illness or unstable chronic medical illness (e.g., unstable angina, myocardial infarction within 6 months, congestive heart failure, clinically significant or concerning cardiac arrhythmias; preexisting hypotension [systolic blood pressure<110] or orthostatic hypotension [systolic drop >20 mm Hg after 2 min standing accompanied by lightheadedness], chronic renal or hepatic failure, acute pancreatitis, Meniere's disease, or diagnosed but untreated sleep apnea). The eligibility of potential participants having acute serious and/or chronic medical illnesses other than those listed will be evaluated on a case-by-case basis by a study physician, PA-C, or ARNP.

The above is a clinical trial exclusion criterion. Annotated with entity spans:
[Qualifier: Acute] or [Qualifier: serious] [Condition: medical illness] or [Qualifier: unstable] [Condition: chronic medical illness] (e.g., [Condition: unstable angina], [Condition: myocardial infarction] [Temporal: within 6 months], [Condition: congestive heart failure], [Qualifier: clinically significant] or [Qualifier: concerning] [Condition: cardiac arrhythmias]; [Temporal: preexisting] [Condition: hypotension] [[Measurement: systolic blood pressure][Value: <110]] or [Condition: orthostatic hypotension] [[Measurement: systolic drop] [Value: >20 mm Hg] [Temporal: after 2 min standing] accompanied by [Condition: lightheadedness]], [Condition: chronic renal] or [Condition: hepatic failure], [Condition: acute pancreatitis], [Condition: Meniere's disease], or diagnosed but [Qualifier: untreated] [Condition: sleep apnea]). [Non-representable: The eligibility of potential participants having acute serious and/or chronic medical illnesses other than those listed will be evaluated on a case-by-case basis by a study physician, PA-C, or ARNP.]